Positive Fortin Finger Test (PMT)

The above is a clinical trial inclusion criterion. Annotated with entity spans:
[Value: Positive] [Measurement: Fortin Finger Test (PMT)]